Clinical trial exclusion criterion:
Patients with a history of allergic reactions to loxapine or amoxapine

Annotated entities:
- Condition: "allergic reactions"
- Drug: "loxapine"
- Drug: "amoxapine"